Pregnancy complicated with pre-eclampsia

The above is a clinical trial exclusion criterion. Annotated with entity spans:
[Condition: Pregnancy] complicated with [Condition: pre-eclampsia]